一位外傷病人，因腹部內出血而施行緊急手術。進入開刀房時，血壓 75/50 mmHg，心跳 110/分。何種麻醉誘導劑較適宜？
A. Propofol
B. Ketamine
C. Thiopental
D. Midazolam

正確答案：B. Ketamine